El elemento de repetición de la estructura del DNA se denomina:
1. Espliceosoma.
2. Nucleosoma.
3. Cromosoma.
4. Replisoma.
5. Primosoma.

Respuesta correcta: 2. Nucleosoma.